Clinical trial exclusion criteria:
Overlap syndrome with Primary Sclerosing Cholangitis (PSC) or Primary Biliary Cholangitis (PBC) (Paris criteria, strong positive Anti-Mitochondrial Antibodies (AMA), past liver biopsy or cholangiographic findings compatible with PBC or PSC).
Presentation with acute liver failure, defined as presence of hepatic encephalopathy and coagulopathy (INR > 1.5)
Current treatment with prednisone/prednisolone and/or immunosuppressive medication for an indication other than autoimmune hepatitis
Current systemic infection
Other clinically significant medical conditions that could interfere with the trial
If female of childbearing potential: known pregnancy, or unwilling to practice anticontraceptive measures.
History of noncompliance with medical regimens, or patients who are considered to be potentially unreliable or unable to participate
Mental instability or incompetence, such that the validity of informed consent or compliance with the trial is uncertain

Annotated entities:
- Condition: "Overlap syndrome"
- Condition: "Primary Sclerosing Cholangitis"
- Condition: "PSC"
- Condition: "Primary Biliary Cholangitis"
- Condition: "PBC"
- Measurement: "Paris criteria,"
- Measurement: "Anti-Mitochondrial Antibodies"
- Value: "strong positive"
- Measurement: "AMA"
- Procedure: "liver biopsy"
- Procedure: "cholangiographic findings"
- Condition: "PBC"
- Condition: "PSC"
- Condition: "acute liver failure"
- Condition: "hepatic encephalopathy"
- Condition: "coagulopathy"
- Measurement: "INR"
- Value: "> 1.5"
- Drug: "prednisone"
- Drug: "prednisolone"
- Drug: "immunosuppressive medication"
- Condition: "autoimmune hepatitis"
- Negation: "other"
- Condition: "indication"
- Condition: "systemic infection"
- Non-query-able: "Other clinically significant medical conditions that could interfere with the trial"
- Pregnancy_considerations: "f female of childbearing potential: known pregnancy, or unwilling to practice anticontraceptive measures"
- Post-eligibility: "History of noncompliance with medical regimens, or patients who are considered to be potentially unreliable or unable to participate"
- Post-eligibility: "Mental instability or incompetence, such that the validity of informed consent or compliance with the trial is uncertain"